El código deontológico de psicología en España se dirige fundamentalmente a:
1. Evaluar la salud mental del terapeuta.
2. Proteger los derechos de los autores de las distintas terapias.
3. Proteger los derechos de los animales de investigación.
4. Proteger los derechos de los sujetos de investigación.
5. Regular la psicología aplicada.

Respuesta correcta: 5. Regular la psicología aplicada.